Clinical trial exclusion criterion:
on hemodialysis for less than 3 months

Entity relations:
- Has_temporal("hemodialysis", "for less than 3 months")